前脈絡叢動脈（anterior choroidal artery）直接起自：
A. 前大腦動脈（anterior cerebral artery）
B. 頸內動脈（internal carotid artery）
C. 後大腦動脈（posterior cerebral artery）
D. 眼動脈（ophthalmic artery）

正確答案：B. 頸內動脈（internal carotid artery）